Clinical trial exclusion criterion:
1. Patient has an allergy to nickel.

Annotated entities:
- Condition: "allergy to nickel"
- Drug: "nickel"